List 3 PD-L1 inhibitors on the market as of 2018.

Atezolizumab (Tecentriq), Avelumab (Bavencio), and Durvalumab (Imfinzi) are PD-L1 inhibitors